¿Qué test NO es una prueba para evaluar el desarrollo general en la infancia?:
1. Inventario de Desarrollo de Levinson.
2. Inventario de Desarrollo Battelle.
3. Escala de Desarrollo de Brunet-Lèzine.
4. Escalas Bayley de Desarrollo Infantil.

Respuesta correcta: 1. Inventario de Desarrollo de Levinson.